UTIs = 12 within 1 year

The above is a clinical trial exclusion criterion. Annotated with entity spans:
[Condition: UTIs] = [Multiplier: 12 within 1 year]